any type of steroid in regular use

The above is a clinical trial exclusion criterion. Annotated with entity spans:
any type of [Drug: steroid] in [Multiplier: regular use]